1. Congestive heart failure;

The above is a clinical trial exclusion criterion. Annotated with entity spans:
1. [Condition: Congestive heart failure];